控制睫狀肌（ciliary muscle）的副交感節前神經纖維（parasympathetic preganglionic fibers），通常經由下列何者進入睫狀神經節（ciliary ganglion）？
A. 動眼神經上分支（superior branch of oculomotor nerve）
B. 動眼神經下分支（inferior branch of oculomotor nerve）
C. 鼻睫神經（nasociliary nerve）
D. 外旋神經（abducent nerve）

正確答案：B. 動眼神經下分支（inferior branch of oculomotor nerve）